Clinical trial inclusion criterion:
Patients presenting with ST-elevation acute myocardial infarction (STEMI) within 12 hours of their symptom onset in whom TIMI-3 flow was established in infarct related artery (IRA) after balloon angioplasty or thrombectomy.

Annotated entities:
- Condition: "ST-elevation acute myocardial infarction (STEMI)"
- Temporal: "within 12 hours of their symptom onset"
- Reference_point: "their symptom onset"
- Observation: "TIMI-3 flow was established"
- Qualifier: "infarct related artery (IRA)"
- Temporal: "after balloon angioplasty or thrombectomy"
- Procedure: "balloon angioplasty"
- Procedure: "thrombectomy"
- Reference_point: "balloon angioplasty or thrombectomy"